Subject has any significant congenital heart defect corrected or not (except for patent foramen ovale that is allowed).

The above is a clinical trial exclusion criterion. Annotated with entity spans:
Subject has any [Qualifier: significant] [Condition: congenital heart defect] corrected or not ([Negation: except] for [Condition: patent foramen ovale] that is allowed).